Which RNA polymerase is used for the replication of viroids?

DNA-dependent RNA polymerase II of plant origin transcribes viroid RNA into full-length copies